Clinical trial inclusion criterion:
= 50 years old.

Annotated entities:
- Person: "old"
- Value: "= 50 years"